Clinical trial exclusion criterion:
Previous discontinuation of treatment with deferiprone or deferoxamine due to adverse events;

Annotated entities:
- Procedure: "discontinuation of treatment"
- Condition: "deferiprone"
- Condition: "deferoxamine"